Clinical trial inclusion criterion:
2. Presence of P. knowlesi malaria, confirmed by positive blood smear with asexual forms of P. knowlesi.

Annotated entities:
- Parsing_Error: "2."
- Condition: "P. knowlesi malaria"
- Measurement: "blood smear"
- Value: "positive"
- Qualifier: "with asexual forms of P. knowlesi"